下列何者為良性家族型血尿（benign familial hematuria）的特徵？
A. 神經性聽障
B. 眼睛水晶體脫位、後白內障
C. 腎絲球基底膜瀰漫性變薄
D. 有腎衰竭的家族史

正確答案：C. 腎絲球基底膜瀰漫性變薄